Clinical trial exclusion criterion:
18. Prior treatment with B cell or lymphocyte-depleting agents (eg, rituximab, Campath)

Entity relations:
- Subsumes("B cell -depleting agents", "rituximab")
- Has_temporal("B cell -depleting agents", "Prior")
- OR("rituximab", "Campath")
- OR("B cell -depleting agents", "lymphocyte-depleting agents")